Clinical trial exclusion criterion:
Patients who are positive for HCV antibody must be negative for HCV by polymerase chain reaction (PCR) to be eligible for study participation

Annotated entities:
- Measurement: "HCV antibody"
- Value: "positive"
- Measurement: "HCV"
- Value: "negative"
- Procedure: "polymerase chain reaction (PCR)"